¿Qué autor propone un modelo de personalidad con dimensiones de temperamento y de carácter?:
1. H.J. Eysenck.
2. J.A. Gray.
3. P.T. Costa y R.R. McCrae.
4. C.R. Cloninger.
5. G. Kelly.

Respuesta correcta: 4. C.R. Cloninger.